Clinical trial inclusion criterion:
Current height less than 5th percentile AND/OR

Annotated entities:
- Temporal: "Current"
- Measurement: "height"
- Value: "less than 5th percentile"
- Non-representable: "AND/OR"